Clinical trial exclusion criterion:
Patients with concomitant HIV infection or congenital immune deficiency diseases.

Annotated entities:
- Condition: "HIV infection"
- Qualifier: "concomitant"
- Condition: "congenital immune deficiency diseases"